懷孕時引起母親及女嬰男性化，最常見的原因為何？
A. Dermoid cyst
B. Luteoma
C. Brenner tumor
D. Yolk sac tumor

正確答案：B. Luteoma